結核桿菌除了會引起肺部結核，也會侵犯身體的其他部位，下列關於結核病（TB）的描述，何者正確？
A. Acid-fast stain 陽性即可診斷結核病
B. 結核桿菌 PCR 檢查的準確度優於 culture
C. BCG 疫苗（卡介苗）可以預防 TB meningitis 以及 miliary TB
D. 肺結核桿菌不會侵犯骨頭

正確答案：C. BCG 疫苗（卡介苗）可以預防 TB meningitis 以及 miliary TB